下列有關臨床監測設施之敘述，何者正確？
A. 由 right internal jugular vein 插入中央靜脈導管，發生氣胸之危險性最大
B. pulse oxymetry 可監測病人目前血中二氧化碳濃度
C. end-tidal CO2可用來判斷氣管內管是否誤插入食道中
D. precordial doppler 用來偵測氣栓（air embolism）最準確

正確答案：C. end-tidal CO2可用來判斷氣管內管是否誤插入食道中